下列有關腦血管病變臨床症狀之敘述，何者為真？
A. 失語症可發生於腦幹中風之病患
B. 單側肢體無力可發生於小腦中風之病患
C. 周邊性之顏面神經麻痺加上對側之肢體無力，需懷疑是腦幹部位之腦中風
D. 前大腦動脈之腦中風通常會導致昏迷及眼球顫動

正確答案：C. 周邊性之顏面神經麻痺加上對側之肢體無力，需懷疑是腦幹部位之腦中風